蒲小姐，40 歲，診斷為 HBe 抗原陰性之慢性 B 型肝炎，目前考慮接受抗病毒治療。下列敘述何者錯誤？
A. 干擾素或口服抗病毒藥物皆可使用
B. 干擾素較口服抗病毒藥物有較多的副作用和抗藥性
C. 干擾素使用 48 週，口服抗病毒藥物一般要使用 1 年以上
D. 行政院衛生署中央健康保險局對干擾素及口服抗病毒藥物均有給付

正確答案：B. 干擾素較口服抗病毒藥物有較多的副作用和抗藥性